Of either gender, aged ≥19 and ≤70 years

The above is a clinical trial inclusion criterion. Annotated with entity spans:
Of either gender, [Person: aged] [Value: ≥19 and ≤70 years]